Clinical trial inclusion criterion:
BMI less than 35

Entity relations:
- Has_value("BMI", "less than 35")